Evidence of sympathetic integrity below the lesion level by the skin axon-reflex vasodilatation (SkARV) test;

The above is a clinical trial exclusion criterion. Annotated with entity spans:
Evidence of [Observation: sympathetic integrity] [Qualifier: below the lesion level] by the skin axon-reflex vasodilatation ([Measurement: SkARV]) [Measurement: test];